Epilepsy

The above is a clinical trial exclusion criterion. Annotated with entity spans:
[Condition: Epilepsy]